關於篩檢的描述何者錯誤？
A. 公費篩檢政策實施當年，癌症的發生率通常會較往年上升
B. 推行子宮頸抹片篩檢會有效降低子宮頸癌死亡率
C. 癌症盛行率會高於發生率
D. 為減少癌症死亡率，應對各種癌症進行公費篩檢

正確答案：D. 為減少癌症死亡率，應對各種癌症進行公費篩檢